大的腎臟癌施行姑息性血管栓塞所發生的症狀包括腰痛、發燒及白血球增加一般會持續幾天？
A. 1天
B. 3天
C. 7天
D. 10天

正確答案：B. 3天